What is marked by DNaseI hypersensitive sites?

DNaseI hypersensitive sites are chromosomal regions up to 2kb distant to known genomic regulatory regions and 5 kb from known regulatory regions.